Clinical trial exclusion criterion:
Presence of local inflammation and/or infection;

Annotated entities:
- Condition: "local inflammation"
- Condition: "local infection"